肘關節發生急性脫臼（acute dislocation）或在復位治療（reduction of dislocation）時，那一條神經最容易受傷？
A. 尺神經
B. 橈神經
C. 正中神經
D. 臂神經

正確答案：C. 正中神經